Clinical trial exclusion criterion:
Estimated life expectancy (due to comorbidities) less than 90 days

Annotated entities:
- Person: "Estimated life expectancy"
- Value: "less than 90 days"